Age 18 to 70 years old

The above is a clinical trial inclusion criterion. Annotated with entity spans:
[Person: Age] [Value: 18 to 70 years old]